Clinical trial exclusion criterion:
Pregnant or lactating female

Entity relations:
- OR("Pregnant", "lactating")